Clinical trial exclusion criterion:
History or evidence of clinically significant disease (eg, malignancy; cardiac, respiratory, gastrointestinal, renal, or psychiatric disease) other than prediabetes (impaired fasting glucose or impaired glucose tolerance), type 2 diabetes treated with oral anti-diabetic agents (excluding sulfonylurea) or non-insulin injectable antidiabetic agents, obstructive sleep apnea, dyslipidemia, and nonalcoholic fatty liver disease

Entity relations:
- Has_qualifier("disease", "cardiac")
- Subsumes("malignancy", "disease")
- Has_temporal("disease", "History")
- AND("malignancy", "disease")
- Has_negation("prediabetes", "other than")
- Has_value("fasting glucose", "impaired")
- Has_negation("sulfonylurea", "excluding")
- Has_qualifier("antidiabetic agents", "injectable")
- Has_qualifier("antidiabetic agents", "non-insulin")
- Subsumes("oral anti-diabetic agents", "sulfonylurea")
- AND("type 2 diabetes", "oral anti-diabetic agents")
- Subsumes("prediabetes", "fasting glucose")
- AND("disease", "prediabetes")
- Subsumes("prediabetes", "impaired fasting glucose")
- OR("cardiac", "psychiatric", "gastrointestinal", "respiratory", "renal")
- OR("History", "clinically significant")
- OR("impaired fasting glucose", "impaired glucose tolerance")
- OR("oral anti-diabetic agents", "nonalcoholic fatty liver disease", "obstructive sleep apnea", "dyslipidemia")
- OR("oral anti-diabetic agents", "antidiabetic agents")
- OR("disease", "type 2 diabetes")